Clinical trial inclusion criterion:
The ability to perform the requirements of the Protocol;

Annotated entities:
- Post-eligibility: "The ability to perform the requirements of the Protocol;"